Eligible for Mifeprex(r) at a study clinical site

The above is a clinical trial inclusion criterion. Annotated with entity spans:
[Mood: Eligible for] [Drug: Mifeprex(r)] at a [Visit: study clinical site]